Patients must not have received prior radiation therapy to the breast.

The above is a clinical trial inclusion criterion. Annotated with entity spans:
Patients must [Negation: not] have received prior [Procedure: radiation therapy] to the breast.